Clinical trial exclusion criterion:
gravidity,

Annotated entities:
- Condition: "gravidity"